subject unaffiliated insurance

The above is a clinical trial exclusion criterion. Annotated with entity spans:
[Non-query-able: subject unaffiliated insurance]